Clinical trial exclusion criterion:
contraindications to epidural analgesia

Entity relations:
- AND("contraindications", "epidural analgesia")